對患有機能性反覆性腹痛（functional recurrent abdominal pain）之兒童而言，下列何項臨床表現最符合此項診斷？
A. 嘔吐物中有膽汁
B. 有水瀉現象
C. 腹痛位於肚臍周圍
D. 半夜容易痛醒

正確答案：C. 腹痛位於肚臍周圍